若您負責醫院的行銷策略，因應全民健康保險之制度改革，下列何者是屬於違法的策略？
A. 開發全民健康保險不給付之服務項目
B. 不收掛號費
C. 加強社區服務
D. 減收部分負擔費用

正確答案：D. 減收部分負擔費用